Clinical trial inclusion criteria:
The subject must be willingly and able to provide written informed consent
Age 19 years of age or older (The age of consent in Nebraska)
HCV treatment-naïve, as defined as no prior exposure to any Interferon (IFN), RBV, or other FDA approved or experimental HCV-specific direct-acting antiviral agent
HCV RNA level at most 6 months prior to the Baseline/Day 1 visit.
HCV genotyping 1a, 1b, or mixed 1a/ab. Any non-definitive results will exclude the subject from study participation.
Alcohol misuse as defined by the Alcohol Use Disorders Identification Test (AUDIT) score subjects must score > 8 (associated with harmful or hazardous drinking)
History of a liver biopsy showing cirrhosis (e.g. Metavir score = 4 or Ishak score > 5)
Fibroscan showing cirrhosis or results > 12.5 kPa
FIBRO Spect II index consistent with F3 or F4 AND an AST : platelet ration index (APRI) of > 2 during Screening
Liver biopsy within 2 years of Screening showing absence of cirrhosis
Fibroscan within 6 months of Baseline/Day1 with a result of = 12.5 kPa
FIBRO Spect II Index consistent with F0- F2 AND APRI of = 1 during Screening
Liver imaging within 6 months of Baseline/Day 1 to exclude hepatocellular carcinoma HCC) is required
ALT < 10 x the upper limit of normal (ULN)
AST < 10 x ULN
Direct bilirubin < 2.0 x ULN
Platelets > 50,000
HbA1c < 8.5%
Creatinine clearance (CLcr) = 60 mL /min, as calculated by the Cockcroft-Gault equation
Hemoglobin = 11 g/dL for female subjects; = 12 g/dL for male subjects.
Albumin = 2.5 g/dL
INR = 1.5 x ULN unless subject has known hemophilia or is stable on an anticoagulant regimen affecting INR.
Subject has not been treated with any investigational drug or device within 30 days of the screening visit.

Annotated entities:
- Post-eligibility: "The subject must be willingly and able to provide written informed consent"
- Value: "19 years of age or older"
- Person: "Age"
- Non-representable: "(The age of consent in Nebraska)"
- Negation: "naïve"
- Procedure: "treatment"
- Condition: "HCV"
- Drug: "Interferon (IFN)"
- Drug: "RBV"
- Non-representable: "other FDA approved or experimental HCV-specific direct-acting antiviral agent"
- Negation: "no"
- Temporal: "prior"
- Measurement: "HCV RNA level"
- Temporal: "at most 6 months prior to the Baseline/Day 1 visit"
- Reference_point: "the Baseline/Day 1 visit"
- Measurement: "HCV genotyping"
- Value: "1a, 1b, or mixed 1a/ab"
- Non-representable: "Any non-definitive results will exclude the subject from study participation."
- Condition: "Alcohol misuse"
- Measurement: "Alcohol Use Disorders Identification Test (AUDIT) score"
- Value: "> 8"
- Procedure: "liver biopsy"
- Condition: "cirrhosis"
- Measurement: "Metavir score"
- Measurement: "Ishak score"
- Value: "= 4"
- Value: "> 5"
- Procedure: "Fibroscan"
- Condition: "cirrhosis"
- Value: "> 12.5 kPa"
- Measurement: "FIBRO Spect II index"
- Measurement: "platelet ration index (APRI)"
- Value: "> 2"
- Temporal: "during Screening"
- Value: "F3 or F4"
- Value: "AST"
- Procedure: "Liver biopsy"
- Temporal: "within 2 years of Screening"
- Condition: "cirrhosis"
- Negation: "absence"
- Procedure: "Fibroscan"
- Temporal: "within 6 months of Baseline/Day1"
- Value: "= 12.5 kPa"
- Measurement: "FIBRO Spect II Index"
- Value: "F0- F2"
- Measurement: "APRI"
- Value: "= 1"
- Temporal: "during Screening"
- Procedure: "Liver imaging"
- Temporal: "within 6 months of Baseline/Day 1"
- Condition: "hepatocellular carcinoma HCC)"
- Negation: "exclude"
- Measurement: "ALT"
- Value: "< 10 x the upper limit of normal (ULN)"
- Measurement: "AST"
- Value: "< 10 x ULN"
- Measurement: "Direct bilirubin"
- Value: "< 2.0 x ULN"
- Measurement: "Platelets"
- Value: "> 50,000"
- Measurement: "HbA1c"
- Value: "< 8.5%"
- Measurement: "Creatinine clearance (CLcr)"
- Value: "= 60 mL /min"
- Qualifier: "Cockcroft-Gault equation"
- Measurement: "Hemoglobin"
- Value: "= 11 g/dL"
- Person: "female"
- Value: "= 12 g/dL"
- Person: "male"
- Measurement: "Albumin"
- Value: "= 2.5 g/dL"
- Measurement: "INR"
- Value: "= 1.5 x ULN"
- Condition: "hemophilia"
- Condition: "stable on an anticoagulant regimen affecting INR"
- Negation: "unless"
- Non-query-able: "Subject has not been treated with any investigational drug or device within 30 days of the screening visit."